Physical disabilities that prohibit task performance (such as blindness or deafness)

The above is a clinical trial exclusion criterion. Annotated with entity spans:
[Subjective_judgement: Physical disabilities that prohibit task performance] (such as [Condition: blindness] or [Condition: deafness])